Clinical trial inclusion criterion:
Patients with relapsing forms of multiple sclerosis (RMS) with active disease defined by clinical or imaging features: (i) at least one clinical relapse over a 6-month period prior to screening; (ii) AND/OR at least one T1 gadolinium-enhancing lesion or new and/or enlarging T2 lesion as detected by brain Magnetic Resonance Imaging (MRI) performed over a 3 months period prior to screening with no change of Disease-Modifying Treatment(s) (DMT) compared to a previous MRI performed within 24 months before screening

Entity relations:
- Has_qualifier("multiple sclerosis (RMS)", "relapsing forms")
- Has_qualifier("multiple sclerosis (RMS)", "active disease")
- Has_context("multiple sclerosis (RMS)", "clinical features")
- Has_multiplier("clinical relapse", "at least one over a 6-month period")
- Has_temporal("clinical relapse", "prior to screening")
- Has_temporal("T2 lesion", "new")
- Has_multiplier("T1 gadolinium-enhancing lesion", "at least one over a 3 months period")
- AND("T1 gadolinium-enhancing lesion", "brain Magnetic Resonance Imaging (MRI)")
- Has_temporal("T1 gadolinium-enhancing lesion", "prior to screening")
- Has_multiplier("Disease-Modifying Treatment(s) (DMT)", "change of")
- Has_negation("change of", "no")
- AND("T1 gadolinium-enhancing lesion", "Disease-Modifying Treatment(s) (DMT)")
- AND("multiple sclerosis (RMS)", "clinical relapse")
- OR("clinical features", "imaging features")
- OR("new", "enlarging")
- OR("T1 gadolinium-enhancing lesion", "T2 lesion")